What is the outcome of TAF10 interacting with the GATA1 transcription factor?

TAF10 Interacts with the GATA1 Transcription Factor and Controls Mouse Erythropoiesis.